En la práctica clínica habitual, en los pacientes infectados por el virus de la inmunodeficiencia humana (VIH) que están siendo sometidos a tratamiento antirretroviral, la herramienta de laboratorio que se utiliza para, a corto plazo, conocer si el tratamiento está siendo eficaz es:
1. Los niveles de linfocitos T CD4, que aumentan rápidamente si el tratamiento está siendo eficaz.
2. Los niveles de anticuerpos anti VIH, que descienden cuando una combinación de antivirales es efectiva.
3. La antigenemia p24, que aumenta en tratamientos eficaces.
4. La carga viral plasmática (ARN del VIH por ml de plasma), que disminuye hasta niveles indetectables en tratamientos eficaces.
5. La intensidad de las bandas que se observan en el Western-blot, que van desapareciendo si el tratamiento es eficaz.

Respuesta correcta: 4. La carga viral plasmática (ARN del VIH por ml de plasma), que disminuye hasta niveles indetectables en tratamientos eficaces.